Severe male factor infertility (Total motile sperm count < 5 million/ml and/or normal WHO morphology <20%).

The above is a clinical trial exclusion criterion. Annotated with entity spans:
[Qualifier: Severe] [Condition: male factor infertility] ([Measurement: Total motile sperm count] [Value: < 5 million/ml] and/or [Measurement: normal WHO morphology] [Value: <20%]).